Clinical trial exclusion criterion:
(1)Women who are pregnant and/or lactating; or women who intend to conceive within a year;

Annotated entities:
- Person: "Women"
- Condition: "pregnant"
- Observation: "lactating"
- Person: "women"
- Observation: "intend to conceive"
- Temporal: "within a year"